下列那一種疾病的症狀，最不適合用功能性電刺激治療？
A. 婦女的應力尿失禁（stress urine incontinence）
B. 脊髓損傷病患的骨質流失（bone loss）
C. 常期臥床的病人防止深部靜脈栓塞（deep vein thrombosis）
D. 治療貝克氏肌肉失養症（Becker muscular dystrophy）疾病的肌肉萎縮

正確答案：D. 治療貝克氏肌肉失養症（Becker muscular dystrophy）疾病的肌肉萎縮